Presence of multiple factors that affect oral medications, such as difficulty swallowing, nausea, vomiting, chronic diarrhea and intestinal obstruction;

The above is a clinical trial exclusion criterion. Annotated with entity spans:
Presence of multiple [Observation: factors that affect oral medications], such as [Condition: difficulty swallowing], [Condition: nausea], [Condition: vomiting], [Condition: chronic diarrhea] and [Condition: intestinal obstruction];